What is the prevalence of the inactivating AKT variant p.Pro50Thr in the Finnish population?

1.1% frequency